What is the main difference between nascent and mature chromatin?

Mature and nascent chromatin differ in two aspects of their histone modifications: polycistronic messengers are expressed as a sequence of individual nucleosomes only in mature cells, and they are preferentially expressed in the later stages of cell development.